Any contra-indication to liver transplantation per center protocol

The above is a clinical trial exclusion criterion. Annotated with entity spans:
Any [Condition: contra-indication] to [Procedure: liver transplantation] per center protocol